¿Cuál de las siguientes estructuras es más externa?:
1. Aracnoides.
2. Piamadre.
3. Médula espinal.
4. Duramadre.

Respuesta correcta: 4. Duramadre.